Subjects with inflammatory bowel disease, active colitis, or pre-existing intra-abdominal inflammation. Diverticulitis without active infection/inflammation will not be excluded.

The above is a clinical trial exclusion criterion. Annotated with entity spans:
Subjects with [Condition: inflammatory bowel disease], [Temporal: active] [Condition: colitis], or [Temporal: pre-existing] [Condition: intra-abdominal inflammation]. [Condition: Diverticulitis] [Negation: without] [Temporal: active] [Condition: infection]/[Condition: inflammation] will [Negation: not be excluded].